Adult patients (older than 18 years of age), male and female, with chronic non-cancer and cancer pain (at least 3 months in duration)

The above is a clinical trial inclusion criterion. Annotated with entity spans:
[Person: Adult] patients ([Value: older than 18 years] of [Person: age]), [Person: male] and [Person: female], with [Qualifier: chronic] [Qualifier: non-cancer] and [Qualifier: cancer] [Condition: pain] ([Multiplier: at least 3 months in duration])